Sickle cell disease

The above is a clinical trial exclusion criterion. Annotated with entity spans:
[Condition: Sickle cell disease]